Clinical trial inclusion criterion:
Age 35-70 years old

Entity relations:
- Has_value("Age", "35-70 years old")